Patients on chronic (longer than the prior 6 months) anticoagulation other than with antiplatelet medications;

The above is a clinical trial exclusion criterion. Annotated with entity spans:
Patients on chronic ([Temporal: longer than the prior 6 months]) [Drug: anticoagulation] [Negation: other than] with [Drug: antiplatelet] medications;